Clinical trial exclusion criterion:
American Society of Anesthesiologist Class 5

Entity relations:
- Has_value("American Society of Anesthesiologist Class", "5")